Which R package could be used for the identification of pediatric brain tumors?

The MethPed classifier, which is a multiclass random forest algorithm, based on DNA methylation profiles from many subgroups of pediatric brain tumors